Clinical trial inclusion criterion:
Creatinine =< 1.5 x upper limit of normal

Entity relations:
- Has_value("Creatinine", "=< 1.5 x upper limit of normal")